下列何者屬於antipseudomonal penicilins，可與 aminoglycoside 併用以治療綠膿桿菌（P. aeruginosa） 所引起的感染？
A. amoxicillin
B. dicloxacillin
C. nafcillin
D. ticarcillin

正確答案：D. ticarcillin